一般而言，哺乳可抑制排卵主要是因何種激素的影響？
A. 雌激素（estrogen）
B. 助孕素（progesterone）
C. 泌乳素（prolactin）
D. 性釋素（GnRH）

正確答案：C. 泌乳素（prolactin）